有關先天肌肉性斜頸（congenital muscular torticollis）之敘述，下列何者錯誤？
A. 因一側的胸舌肌（sternohyoid muscle）緊縮而引起
B. 二個月內嬰兒常因頸部腫塊（palpable lump）而被診斷
C. 約有 20%的患者伴隨有髖關節生長性發育不良（developmental dysplasia of hip）
D. 伸展運動（stretching exercise）治療通常有好結果

正確答案：A. 因一側的胸舌肌（sternohyoid muscle）緊縮而引起